healthy

The above is a clinical trial inclusion criterion. Annotated with entity spans:
[Condition: healthy]